Patients with complex antibody profile in which it is impossible to match RBC units

The above is a clinical trial exclusion criterion. Annotated with entity spans:
Patients with [Condition: complex antibody profile] in which it is [Observation: impossible to match RBC units]